Clinical trial inclusion criterion:
Male or female patients age 18 years or older, with relapsed or refractory sALCL who have previously received at least 1 multiagent chemotherapy

Entity relations:
- Has_multiplier("chemotherapy", "at least 1")
- Has_qualifier("sALCL", "relapsed")
- Has_value("age", "18 years or older")
- AND("sALCL", "chemotherapy")
- OR("relapsed", "refractory")
- OR("Male", "female")